Clinical trial inclusion criterion:
Patient with known CYP2C19 genotype prior to randomization

Annotated entities:
- Condition: "CYP2C19 genotype"
- Temporal: "prior to randomization"
- Reference_point: "randomization"